Which is the primary protein component of Lewy bodies?

The primary protein component of Lewy bodies are fibrils composed of alpha-synuclein.